假設有抽菸族群的血中古丁尼濃度（ng/ml）為常態分配（平均值=11, 變異數=16），無抽菸族群的血中古丁尼濃度則為常態分配 （平均值=6, 變異數=16）。某研究提出可利用血中古丁尼濃度大於 7 判定為有抽菸者，此規則所犯的偽陽率（false positive rate）為 0.25，偽陰率（false negative rate）為 0.15。若將判定抽菸標準提高到血中古丁尼濃度大於 8.5，偽陽率與敏感度（sensitivity）會如何改變？
A. 偽陽率下降，敏感度下降
B. 偽陽率下降，敏感度上升
C. 偽陽率上升，敏感度下降
D. 偽陽率上升，敏感度上升

正確答案：A. 偽陽率下降，敏感度下降